previous use of insulin pump

The above is a clinical trial exclusion criterion. Annotated with entity spans:
previous use of [Device: insulin pump]